Clinical trial inclusion criterion:
Urine cotinine level ? 100 ng/ml (NicAlert(r) reading ? 3)

Annotated entities:
- Measurement: "Urine cotinine level"
- Value: "? 100 ng/ml"
- Measurement: "NicAlert(r)"
- Value: "? 3"